Clinical trial exclusion criterion:
Has ever received any cytotoxic drugs, including chlorambucil, cyclophosphamide, nitrogen mustard, or other alkylating agents

Entity relations:
- Subsumes("cytotoxic drugs", "chlorambucil")
- OR("chlorambucil", "alkylating agents", "cyclophosphamide", "nitrogen mustard")